Clinical trial exclusion criterion:
Known renal failure or allergy to acetazolamide and other sulfonamides

Annotated entities:
- Condition: "renal failure"
- Condition: "allergy"
- Drug: "acetazolamide"
- Drug: "sulfonamides"
- Qualifier: "other"